Clinical trial inclusion criterion:
Adult subjects aged 18 years or older

Annotated entities:
- Person: "Adult"
- Person: "aged"
- Value: "18 years or older"